What are 2 organisms that can cause Human toxocariasis?

human toxocariasis, a worldwide parasitic disease, is caused by the larval stage of intestinal nematodes of dogs and cats, namely toxocara canis and toxocara cati